In addition to the above, other diseases that the investigator judges to be inappropriate.

The above is a clinical trial exclusion criterion. Annotated with entity spans:
[Non-query-able: In addition to the above, other diseases that the investigator judges to be inappropriate].